Clinical trial inclusion criterion:
Patients presenting for CMR with the clinical diagnosis of hypertrophic cardiomyopathy based on left ventricular wall thickness of at least =15 mm in the absence of any other cardiac or systemic cause of hypertrophy

Annotated entities:
- Condition: "hypertrophic cardiomyopathy"
- Measurement: "left ventricular wall thickness"
- Value: "at least =15 mm"
- Negation: "absence"
- Condition: "systemic cause of hypertrophy"
- Condition: "cardiac cause of hypertrophy"